Reslizumab is a humanized monoclonal antibody to treat what specific type of asthma?

Reslizumab in the treatment of severe eosinophilic asthma: an update.